Trauma recent face, nausea and vomiting.

The above is a clinical trial exclusion criterion. Annotated with entity spans:
[Condition: Trauma] recent face, [Condition: nausea] and [Condition: vomiting].